Clinical trial inclusion criterion:
A spasticity : a Tardieu score upper or equal to 2 on at least one of the following muscle-triceps surae, flexors of fingers, of wrist and of elbow

Annotated entities:
- Condition: "spasticity"
- Measurement: "Tardieu score"
- Value: "upper or equal to 2"
- Multiplier: "at least one"
- Qualifier: "muscle-triceps surae"
- Qualifier: "flexors of fingers"
- Qualifier: "wrist"
- Qualifier: "elbow"